Systolic blood pressure = 180 mmHg or diastolic blood pressure = 110 mm Hg at the baseline visit.

The above is a clinical trial exclusion criterion. Annotated with entity spans:
[Measurement: Systolic blood pressure] [Value: = 180 mmHg] or [Measurement: diastolic blood pressure] [Value: = 110 mm Hg] [Temporal: at the baseline visit].